一位 17 歲女孩患有 endodermal sinus tumor，則下列敘述何者錯誤？
A. 可能發生於兩側卵巢，因此對側卵巢須切片
B. 甲型胎兒蛋白（alpha-fetoprotein）可能會升高
C. 術後須加上化學治療
D. 又稱為卵黃囊癌（yolk sac carcinoma）

正確答案：A. 可能發生於兩側卵巢，因此對側卵巢須切片